Are willing/able to adhere to the prohibitions and restrictions specified in the protocol and study procedures

The above is a clinical trial inclusion criterion. Annotated with entity spans:
[Post-eligibility: Are willing/able to adhere to the prohibitions and restrictions specified in the protocol and study procedures]